Clinical trial exclusion criterion:
Presence of tachycardia with irregular or supraventricular RR

Annotated entities:
- Condition: "tachycardia"
- Condition: "irregular RR"
- Condition: "supraventricular RR"